Active infection with human cytomegaly virus (HCMV), Epstein-Barr virus (EBV), varicella-zoster virus (VZV)

The above is a clinical trial exclusion criterion. Annotated with entity spans:
[Qualifier: Active] [Condition: infection] with [Qualifier: human cytomegaly virus] ([Qualifier: HCMV]), [Qualifier: Epstein-Barr virus] ([Qualifier: EBV]), [Qualifier: varicella-zoster virus] ([Qualifier: VZV])